Clinical trial exclusion criterion:
History of vitrectomy surgery, submacular surgery, or other surgical intervention for RVO

Entity relations:
- AND("surgical intervention", "RVO")
- OR("vitrectomy surgery", "submacular surgery", "surgical intervention")